Clinical trial exclusion criterion:
glaucoma

Annotated entities:
- Condition: "glaucoma"